Clinical trial exclusion criterion:
Patient whom the surgery is converted to laparotomy

Entity relations:
- AND("converted to", "laparotomy")
- Has_context("surgery", "converted to")